下列那一個分子最不可能經由嘌呤回收（purine salvage）途徑再利用？
A. adenine
B. guanine
C. xanthine
D. hypoxanthine

正確答案：C. xanthine